Clinical trial exclusion criterion:
7. Unwilling or unable to cease using the following medications during the study period: Topical ocular cyclosporine (e.g. Restasis®), anti-histamines, antipsychotics, or eye gels.

Entity relations:
- Subsumes("Topical ocular cyclosporine", "Restasis®")
- Has_index("during the study period", "study period")
- Has_temporal("Topical ocular cyclosporine", "during the study period")
- OR("Topical ocular cyclosporine", "antipsychotics", "anti-histamines", "eye gels")